choroidal neovascularization caused by age-related macula degeneration

The above is a clinical trial inclusion criterion. Annotated with entity spans:
[Condition: choroidal neovascularization] caused by [Qualifier: age-related] [Condition: macula degeneration]